Clinical trial exclusion criterion:
contraindication to ketamine and lidocaine

Annotated entities:
- Drug: "ketamine"
- Drug: "lidocaine"
- Condition: "contraindication"